Chronic Pulmonary Condition other than asthma

The above is a clinical trial exclusion criterion. Annotated with entity spans:
[Condition: Chronic Pulmonary Condition] [Negation: other] than [Condition: asthma]